Cuál de las afirmaciones siguientes sobre la estructura proteica es correcta:
1. La configuración de la lámina β no se encuentra en las proteínas globulares.
2. La estabilidad de la hélice α se debe principalmente a las interacciones hidrófobas.
3. Las proteínas globulares se pliegan en configuraciones que mantienen las cadenas laterales hidrófobas en el interior de la molécula.
4. La estructura primaria de un péptido no influye en la formación de la configuración tridimensional nativa.

Respuesta correcta: 3. Las proteínas globulares se pliegan en configuraciones que mantienen las cadenas laterales hidrófobas en el interior de la molécula.